下列致癌基因的功能何者不可歸類為細胞內訊息傳遞的角色？
A. ABL
B. BRAF
C. ERBB2
D. β-catenin

正確答案：C. ERBB2